Clinical trial inclusion criterion:
Never receiving adequate treatment or stop receiving treatment for at least 8 weeks

Annotated entities:
- Negation: "Never"
- Procedure: "treatment"
- Qualifier: "adequate"
- Negation: "stop"
- Procedure: "treatment"
- Temporal: "for at least 8 weeks"